2. Be 18 55 years of age.

The above is a clinical trial inclusion criterion. Annotated with entity spans:
[Parsing_Error: 2.] Be [Value: 18 55 years] of [Person: age].